who have been optimized on Guideline Directed treatment for heart failure for at least a month prior to enrolling.

The above is a clinical trial inclusion criterion. Annotated with entity spans:
[Non-representable: who have been optimized on Guideline Directed treatment for heart failure for at least a month prior to enrolling.]